病患的上眼瞼下垂（ptosis），最可能是由於下列何者受損所造成？
A. 外旋神經（abducent nerve）
B. 滑車神經（trochlear nerve）
C. 視神經（optic nerve）
D. 動眼神經（oculomotor nerve）

正確答案：D. 動眼神經（oculomotor nerve）